En el entrenamiento básico en autoinstrucciones para niños y adolescentes, la fase en la que un modelo lleva a cabo una tarea mientras se habla en voz alta se denomina:
1. Guiado externo en voz alta.
2. Autoinstrucciones enmascaradas.
3. Modelado cognitivo.
4. Autoinstrucciones encubiertas.

Respuesta correcta: 3. Modelado cognitivo.